Cuando la radiación electromagnética pasa del aire a un medio como el vidrio su longitud de onda:
1. Permanece inalterada.
2. Aumenta aproximadamente 10 nm.
3. Aumenta aproximadamente 100 nm.
4. Disminuye aproximadamente 1 nm.
5. Disminuye aproximadamente 200 nm.

Respuesta correcta: 5. Disminuye aproximadamente 200 nm.